Antitumor therapy (e.g., chemotherapy, hormonal therapy, immunotherapy, antibody therapy, radiotherapy), or investigational agent or therapy <=30 days before first dose of study treatment or not recovered from any acute toxicity.

The above is a clinical trial exclusion criterion. Annotated with entity spans:
[Procedure: Antitumor therapy] (e.g., [Procedure: chemotherapy], [Procedure: hormonal therapy], [Procedure: immunotherapy], [Procedure: antibody therapy], [Procedure: radiotherapy]), or [Drug: investigational agent] or [Procedure: therapy] [Temporal: <=30 days before first dose of study treatment] or [Condition: not recovered from any acute toxicity].